Clinical trial inclusion criterion:
increased risk of bradycardia events (Sick Sinus, AV block grade II or III, bradycardia-induced syncope)

Entity relations:
- Has_value("grade", "II or III")
- AND("AV block", "grade")
- Subsumes("bradycardia events", "Sick Sinus")
- Has_mood("bradycardia events", "increased risk")
- OR("Sick Sinus", "AV block", "bradycardia-induced syncope")